Chest pain or shortness of breath with activity (such as climbing stairs), peripheral edema, heart palpitations, dry cough, irregular heartbeat, excessive fatigue, unexplained syncope

The above is a clinical trial exclusion criterion. Annotated with entity spans:
[Condition: Chest pain] or [Condition: shortness of breath with activity] (such as climbing stairs), [Condition: peripheral edema], [Condition: heart palpitations], [Condition: dry cough], [Condition: irregular heartbeat], [Condition: excessive fatigue], unexplained [Condition: syncope]